一位 37 歲男性工人從工地掉下來，理學檢查時病人意識清楚，但發現尿道口有血跡，而且陰囊有血腫，會陰有淤傷，接下來你最先要安排何種檢查？
A. Intravenous pyelogram
B. Cystography
C. Retrograde urethrogram
D. Contrast-enhanced computed tomography

正確答案：C. Retrograde urethrogram